presence of stress urinary or urgency incontinence

The above is a clinical trial inclusion criterion. Annotated with entity spans:
presence of [Condition: stress urinary] or [Condition: urgency incontinence]